How many genes are in the gene signature screened by MammaPrint?

Mammaprint has a 70 gene signature.